Clinical trial exclusion criterion:
Discharge from the operating hospital to an ICU at another hospital

Annotated entities:
- Observation: "Discharge"
- Visit: "operating hospital"
- Visit: "ICU"
- Qualifier: "another"
- Visit: "hospital"